Clinical trial inclusion criterion:
age 18-65 years

Entity relations:
- Has_value("age", "18-65 years")